Clinical trial exclusion criterion:
Injection drug users with a fever

Annotated entities:
- Person: "drug users"
- Condition: "fever"